Clinical trial exclusion criterion:
patient refusal.

Annotated entities:
- Informed_consent: "patient refusal"